Location of distal biliary obstruction is such that it would allow the proximal end of a stent to be positioned at least 2cm from the hilum

The above is a clinical trial inclusion criterion. Annotated with entity spans:
Location of [Condition: distal biliary obstruction] is such that it [Mood: would allow] the proximal end of a [Procedure: stent] to be positioned [Qualifier: at least 2cm from the hilum]